將地磚的花紋看成是蟲在地上爬，以致於不敢下床走路，此症狀是：
A. 幻覺（hallucination）
B. 錯覺（illusion）
C. 假性幻覺（pseudo-hallucination）
D. 妄想（delusion）

正確答案：B. 錯覺（illusion）